What is measured with the Proseek panels?

Differnet Proseek multiplex protein biomarker panels exists: CVD, inflammatory, neurology and oncology biomarker.